What is caused by bi-allelic loss-of-function variants in IPO8?

Syndromic thoracic aortic aneurysm